Adult patients (= 18 years)

The above is a clinical trial inclusion criterion. Annotated with entity spans:
[Person: Adult] patients ([Value: = 18] [Person: years])